小腦與下列何者之聯繫不經行在下小腦腳中？
A. 脊髓
B. 下橄欖核
C. 紅核
D. 楔狀核

正確答案：C. 紅核